Clinical trial exclusion criterion:
Congenital or acquired coagulopathy as evidence by INR >1.4 or PTT > 1.4 times normal, or Platelets <150,000/mm3 on preoperative laboratory testing

Entity relations:
- Has_qualifier("coagulopathy", "Congenital")
- Has_value("PTT", "> 1.4 times normal")
- Has_value("INR", ">1.4 times normal")
- AND("coagulopathy", "INR")
- Has_value("Platelets", "<150,000/mm3")
- AND("preoperative laboratory testing", "Platelets")
- OR("Congenital", "acquired")
- OR("INR", "PTT")
- OR("coagulopathy", "Platelets")